Clinical trial inclusion criterion:
Experience with frequent (2-7 times per week) infusions of IgPro20 at the tolerated flow rate of approximately 0.5 mL/min (equivalent of 25-30 mL/h) per injection site for at least 1 month prior to Day 1. The dose (volume) per injection site should not exceed 25 mL.

Annotated entities:
- Qualifier: "frequent"
- Drug: "IgPro20"
- Multiplier: "per injection site flow rate of approximately 0.5 mL/min"
- Multiplier: "25-30 mL/h"
- Temporal: "for at least 1 month prior to Day 1"
- Reference_point: "Day 1"
- Multiplier: "2-7 times per week"
- Negation: "not"
- Multiplier: "exceed 25 mL."